Clinical trial exclusion criterion:
13. Treatment with systemic corticosteroids (>15 mg/day), or current immunosuppressive agents

Entity relations:
- Has_value("systemic corticosteroids", ">15 mg/day")
- AND("Treatment", "systemic corticosteroids")
- Has_temporal("immunosuppressive agents", "current")
- OR("Treatment", "immunosuppressive agents")